下列何者不是腹腔鏡腹股溝疝氣修補手術（laparoscopic inguinal hernia repair）之優點？
A. 能在腹膜前腔（preperitoneal space）放置大片人工網膜
B. 較容易以人工網膜覆蓋肌恥骨孔（myopectineal orifice）
C. 相較於傳統修補手術，有明顯較低的復發率
D. 適合治療雙側疝氣或復發性疝氣

正確答案：C. 相較於傳統修補手術，有明顯較低的復發率